Clinical trial inclusion criterion:
Normal baseline cardiac function based upon pre-operative evaluation

Annotated entities:
- Measurement: "cardiac function"
- Value: "Normal"
- Measurement: "baseline"
- Procedure: "pre-operative evaluation"
- Temporal: "pre-operative"